Pregnancy/breastfeeding

The above is a clinical trial exclusion criterion. Annotated with entity spans:
[Condition: Pregnancy]/[Observation: breastfeeding]